Con respecto a las características de los aminoácidos, indique cuál de las siguientes afirmaciones es falsa:
1. Los aminoácidos son sustancias anfóteras que pueden actuar como ácidos o como bases.
2. Las cadenas laterales de los aminoácidos pueden ser apolares, polares sin carga o pueden presentar carga a determinados valores de pH.
3. La cadena lateral de la Ala puede sufrir un proceso de fosforilación.
4. Las proteínas están constituidas por Laminoácidos.
5. Los aminoácidos Ser, Thr y Tyr pueden formar enlaces ester con un grupo fosfato.

Respuesta correcta: 3. La cadena lateral de la Ala puede sufrir un proceso de fosforilación.